¿Cuál de los siguientes aspectos formales del estilo terapéutico forman parte de la entrevista motivacional?:
1. Asumir un papel directivo durante la terapia.
2. Promover empatía.
3. Utilizar estrategias coercitivas.
4. Emplear etiquetas diagnósticas.
5. Favorecer las discusiones para activar las resistencias.

Respuesta correcta: 2. Promover empatía.